Recently diagnosed type 2 diabetic patients.

The above is a clinical trial inclusion criterion. Annotated with entity spans:
[Temporal: Recently diagnosed] [Condition: type 2 diabetic] patients.